has a history of taste or smell loss or other oral disorders (e.g., burning mouth syndrome)

The above is a clinical trial exclusion criterion. Annotated with entity spans:
has a [Temporal: history] of [Condition: taste] or [Condition: smell loss] or [Qualifier: other] [Condition: oral disorders] (e.g., [Condition: burning mouth syndrome])